Clinical trial inclusion criterion:
Women between 40 to 70 years of age.

Annotated entities:
- Person: "Women"
- Value: "between 40 to 70 years"
- Person: "age"